Age 18 or older.

The above is a clinical trial inclusion criterion. Annotated with entity spans:
[Person: Age] [Value: 18 or older].